All patients presenting for elective shoulder arthroscopic procedures will be eligible for enrollment.

The above is a clinical trial inclusion criterion. Annotated with entity spans:
All patients presenting for [Qualifier: elective] [Procedure: shoulder arthroscopic procedures] will be eligible for enrollment.